Clinical trial exclusion criterion:
Inability to provide informed consent

Annotated entities:
- Informed_consent: "Inability to provide informed consent"